Clinical trial exclusion criterion:
Conversion from laparoscopic to open surgery

Annotated entities:
- Non-representable: "Conversion from laparoscopic to open surgery"